Clinical trial inclusion criteria:
1. Male or female, 18-75 years old.
2. Has a diagnosis of WHO Group 1 PAH.
3. Right heart catheterization performed at Screening with results that are:
1. Mean pulmonary arterial pressure ≥25 mmHg (at rest) and
2. Pulmonary venous hypertension (measured as pulmonary capillary wedge pressure (PCWP) ≤15 mmHg. If PCWP is not available, then mean left atrial pressure or left ventricular end-diastolic pressure ≤15 mmHg in the absence of left atrial obstruction. and
3. Pulmonary vascular resistance (PVR) ≥300 dyn•s/cm5 (3.75 Wood units)
4. Has WHO/NYHA-FC of II or III.
5. Be on stable dose of at least one of the following PAH-specific therapies: endothelin receptor antagonist, an agent acting on the nitric oxide pathway (phosphodiesterase type 5 inhibitor or soluble guanylate cyclase stimulator), and/or a prostacyclin or prostacyclin analog.
6. Has a 6-minute walk distance that is ≥150 and ≤500 meters.
7. Have a ventilation-perfusion scan that rules out thromboembolic disease.

Annotated entities:
- Parsing_Error: "1."
- Person: "Male"
- Person: "female"
- Value: "18-75 years"
- Person: "years old"
- Parsing_Error: "2."
- Measurement: "WHO Group"
- Value: "1"
- Condition: "PAH"
- Parsing_Error: "3."
- Procedure: "Right heart catheterization"
- Parsing_Error: "Right heart catheterization performed at Screening with results that are:"
- Temporal: "performed at Screening"
- Reference_point: "Screening"
- Parsing_Error: "1."
- Measurement: "Mean pulmonary arterial pressure"
- Value: "≥25 mmHg"
- Qualifier: "at rest"
- Parsing_Error: "2."
- Condition: "Pulmonary venous hypertension"
- Measurement: "pulmonary capillary wedge pressure (PCWP)"
- Value: "≤15 mmHg"
- Condition: "mean left atrial pressure"
- Condition: "left ventricular end-diastolic pressure"
- Value: "≤15 mmHg"
- Negation: "absence"
- Condition: "left atrial obstruction"
- Parsing_Error: "3."
- Condition: "Pulmonary vascular resistance (PVR)"
- Value: "≥300 dyn•s/cm5"
- Value: "3.75 Wood units"
- Parsing_Error: "4."
- Measurement: "WHO/NYHA-FC"
- Value: "II"
- Value: "III"
- Parsing_Error: "5."
- Qualifier: "stable dose"
- Multiplier: "at least one"
- Procedure: "PAH-specific therapies"
- Drug: "endothelin receptor antagonist"
- Drug: "agent acting on the nitric oxide pathway"
- Drug: "phosphodiesterase type 5 inhibitor"
- Drug: "soluble guanylate cyclase stimulator"
- Drug: "prostacyclin analog"
- Drug: "prostacyclin analog"
- Parsing_Error: "6."
- Measurement: "6-minute walk distance"
- Value: "≥150 and ≤500 meters"
- Parsing_Error: "7."
- Procedure: "ventilation-perfusion scan"
- Condition: "thromboembolic disease"
- Negation: "rules out"